Clinical trial exclusion criterion:
Bleeding diathesis, thrombocytopenia, or use of anticoagulants that would contraindicate lumbar puncture.

Annotated entities:
- Condition: "Bleeding diathesis"
- Condition: "thrombocytopenia"
- Drug: "anticoagulants"
- Condition: "contraindicate"
- Procedure: "lumbar puncture"